Clinical trial exclusion criterion:
acute cardiovascular or cerebrovascular accidents within past 3 months;

Entity relations:
- Has_qualifier("cerebrovascular accidents", "acute")
- Has_temporal("cerebrovascular accidents", "within past 3 months")
- OR("cerebrovascular accidents", "accidents cardiovascular")